(ii) measles (M) or measles, mumps, rubella (MMR) routine vaccination, which can be administered concomitantly with the first dose of study vaccine as per routine immunization schedule

The above is a clinical trial exclusion criterion. Annotated with entity spans:
(ii) [Procedure: measles (M)] or [Procedure: measles, mumps, rubella (MMR)] routine vaccination, which can be administered [Temporal: concomitantly with the first dose of study vaccine] as per routine immunization schedule